Expected survival time=3 months;

The above is a clinical trial inclusion criterion. Annotated with entity spans:
[Observation: Expected survival time=][Value: 3 months];